¿Cuáles son los sistemas endocrinos más frecuentemente implicados en los trastornos depresivos?:
1. El eje hipotálamo-hipófiso-adrenal y el eje tiroideo.
2. El eje hipotálamo-amígdalo-adrenal y eje tiroideo.
3. El eje hipotálamo-hipófiso-noradrenal y el eje tiroideo.
4. El eje hipotálamo-hipófiso-adrenal y el eje paratiroideo.

Respuesta correcta: 1. El eje hipotálamo-hipófiso-adrenal y el eje tiroideo.